Meibomian Gland Dysfunction

The above is a clinical trial inclusion criterion. Annotated with entity spans:
[Condition: Meibomian Gland Dysfunction]